Clinical trial inclusion criterion:
Caucasian patients affected by uncomplicated, essential hypertension, not well controlled by concomitant administration of ACE-I or ARBs and diuretics at the maximum dosage.

Entity relations:
- Has_qualifier("essential hypertension", "uncomplicated")
- Has_multiplier("diuretics", "maximum dosage")
- Has_multiplier("ACE-I", "maximum dosage")
- Has_multiplier("ARBs", "maximum dosage")
- Has_qualifier("essential hypertension", "not well controlled")
- AND("not well controlled", "ACE-I")
- AND("not well controlled", "diuretics")
- OR("ACE-I", "ARBs")